在心肌梗塞之後，除了下列何種情形外，皆須緊急或儘快進行開心手術？
A. 梗塞後持續心絞痛
B. 左心室瘤發生
C. 乳頭肌破裂造成二尖瓣閉鎖不全
D. 心肌壞死造成心室中隔缺損

正確答案：B. 左心室瘤發生